一位 45 歲婦女就診時抱怨皮膚搔癢，理學檢查發現眼瞼上有黃色瘤（xanthelasma），血液檢查發現鹼性磷酸酶（ALP），膽固醇及 IgM 值昇高，anti-mitochondria antibody 為陽性反應，下列何項為最適當之診斷？
A. 藥物性肝炎
B. 阻塞性黃疸
C. 原發性膽管性肝硬化（Primary biliary cirrhosis）
D. 原發性硬化性膽管炎（Primary sclerosing cholangitis）

正確答案：C. 原發性膽管性肝硬化（Primary biliary cirrhosis）